¿Cuál de las siguientes técnicas de endoscopia digestiva, está asociada a mayor riesgo de complicaciones mayores?
1. Ecoendoscopia digestiva alta diagnóstica.
2. Esclerosis de varices esofágicas.
3. Colonoscopia diagnóstica en paciente con dolicocolon.
4. Polipectomía de pólipo en colon descendente de morfología sesil.

Respuesta correcta: 2. Esclerosis de varices esofágicas.